Prior systemic therapy targeting PD-1: PD-L1 axis.

The above is a clinical trial exclusion criterion. Annotated with entity spans:
Prior [Procedure: systemic therapy targeting PD-1: PD-L1 axis].